Must be in general good health as judged by the Investigator, based on medical history and physical examination.

The above is a clinical trial inclusion criterion. Annotated with entity spans:
[Non-query-able: Must be in general good health as judged by the Investigator, based on medical history and physical examination].